Clinical trial exclusion criterion:
Known history or present abuse of alcohol or drugs

Entity relations:
- AND("history", "abuse of alcohol")
- OR("history", "present")
- OR("abuse of alcohol", "abuse of drugs")